Es una enfermedad producida por una bacteria patógena de transmisión alimentaria:
1. La listeriosis.
2. La enfermedad de Lyme.
3. La tularemia.
4. La escarlatina.
5. El impétigo.

Respuesta correcta: 1. La listeriosis.